Colorectal adenomatous polyp with focal invasive carcinoma 是表示 cancer 已 extend through polyp 的那個 layer？
A. mucosa
B. submucosa
C. muscularis mucosae
D. muscularis propria

正確答案：C. muscularis mucosae